Clinical trial inclusion criterion:
PSA criteria:

Annotated entities:
- Non-representable: "PSA criteria"